Use of any kind of medication under investigation within one year before the vaccination.

The above is a clinical trial exclusion criterion. Annotated with entity spans:
Use of any kind of [Drug: medication under investigation] [Temporal: within one year before the vaccination].